Un hombre de 52 años sin enfermedades concomitantes, acude a urgencias por melenas de 24 horas de evolución sin repercusión hemodinámica. Niega consumo de antiinflamatorios no esteroideos. El hematocrito es de 33% y esl resto de la analítica es normal. La endoscopia digestiva alta realizada de forma urgente a las 6 horas del ingreso muestra un estómago normal, sin sangre ni restos hemáticos y una úlcera excavada de 8 mm de diámetro en cara anterior del bulbo duodenal con "vaso visible" en su base y sin sangrado activo. ¿Cuál de las siguientes afirmaciones es cierta?
1. En la endoscopia inicial está indicado aplicar una terapéutica endoscópica y posteriormente instaurar tratamiento endovenoso con dosis altas de un inhibidor de la bomba de protones. Esta estrategia ha demostrado reducir el riesgo de recidiva hemorrágica y la mortalidad.
2. En la endoscopia inicial, dada la ausencia de sangrado activo, no está indicado aplicar una terapéutica endoscópica. Posteriormente, para reducir el riesgo de recidiva hemorrágica, se deberá instaurar tratamiento endovenoso con dosis altas de un inhibidor de la bomba de protones.
3. En la endoscopia inicial está indicado aplicar una terapéutica endoscópica. No se ha podido demostrar que instaurar posteriormente tratamiento endovenoso con dosis altas de un inhibidor de la bomba de protones aporte beneficio adicional alguno.
4. Dado que se trata de una úlcera complicada (hemorragia) la mejor opción terapéutica una vez resuelto el episodio hemorrágico, es una vagotomía y piloroplastia.

Respuesta correcta: 1. En la endoscopia inicial está indicado aplicar una terapéutica endoscópica y posteriormente instaurar tratamiento endovenoso con dosis altas de un inhibidor de la bomba de protones. Esta estrategia ha demostrado reducir el riesgo de recidiva hemorrágica y la mortalidad.